Clinical trial inclusion criterion:
Advanced hormone-dependent prostate cancer for which androgen deprivation therapy is indicated, and independently from this trial, Firmagon® is intended to be used for treatment

Entity relations:
- AND("prostate cancer", "androgen deprivation therapy")
- Has_qualifier("prostate cancer", "hormone-dependent")
- Has_qualifier("prostate cancer", "Advanced")
- Has_mood("Firmagon", "intended")
- AND("prostate cancer", "Firmagon")